Clinical trial inclusion criterion:
Receiving a prescription of Adalimumab 40 mg subcutaneous every two weeks.

Annotated entities:
- Drug: "Adalimumab"
- Multiplier: "40 mg every two weeks"
- Qualifier: "subcutaneous"